RELIANCE 4-Front Study outcome (i.e. involve medications that could affect the heart rate of the subject);

The above is a clinical trial exclusion criterion. Annotated with entity spans:
[Non-query-able: RELIANCE 4-Front Study outcome (i.e. involve medications that could affect the heart rate of the subject);]